Clinical trial inclusion criterion:
Prior to the acute attack of LBP, back pain cannot occur more frequently than once per month. Patients with more frequent back pain are at increased risk of poor pain and functional outcomes.(9)

Entity relations:
- Has_temporal("attack of LBP", "acute")
- Has_index("Prior to the acute attack of LBP", "acute attack of LBP")
- multi("acute attack of LBP", "attack of LBP")
- Has_negation("more frequently than once per month", "cannot")
- Has_multiplier("back pain", "more frequently than once per month")
- Has_temporal("back pain", "Prior to the acute attack of LBP")